El hidruro de aluminio y litio es un nucleófilo suficientemente fuerte para adicionarse al grupo carbonilo de los iones carboxilato. Este proceso permite la reducción de ácidos carboxílicos a:
1. Alcanos.
2. Alcoholes primarios.
3. Alcoholes secundarios.
4. Cetonas.

Respuesta correcta: 2. Alcoholes primarios.